4. Pregnancy within the past 6 months and/or breast-feeding

The above is a clinical trial exclusion criterion. Annotated with entity spans:
4. [Condition: Pregnancy] [Temporal: within the past 6 months] and/or [Condition: breast-feeding]